Clinical trial exclusion criterion:
rituximab

Annotated entities:
- Drug: "rituximab"